Clinical trial inclusion criterion:
5. Capacity to provide consent to participate in research (assessment made by study physician)

Annotated entities:
- Non-query-able: "Capacity to provide consent to participate in research (assessment made by study physician)"
- Post-eligibility: "Capacity to provide consent to participate in research (assessment made by study physician)"